Clinical trial exclusion criterion:
history of gastric resection surgery

Annotated entities:
- Procedure: "gastric resection surgery"